Clinical trial exclusion criterion:
Chronic renal failure (GFR < 30 ml/min)

Entity relations:
- Has_multiplier("renal failure", "Chronic")
- Has_value("GFR", "< 30 ml/min")
- Subsumes("renal failure", "GFR")